Clinical trial exclusion criterion:
Thrombosis in left atrium;

Entity relations:
- Has_qualifier("Thrombosis", "left atrium")